Clinical trial exclusion criterion:
Excessive alcohol use (>14 drinks/week)

Entity relations:
- Has_multiplier("alcohol use", ">14 drinks/week")